Clinical trial exclusion criterion:
eGFR < 60ml/min/1.73m2

Annotated entities:
- Measurement: "eGFR"
- Value: "< 60ml/min/1.73m2"